Clinical trial inclusion criterion:
Good health condition, without clinically significant medical history (by participant or guardian, in case of minor)

Annotated entities:
- Condition: "Good health condition"
- Negation: "without"
- Qualifier: "clinically significant"
- Temporal: "medical history"